Person affiliated to social security or beneficiary of such a scheme

The above is a clinical trial inclusion criterion. Annotated with entity spans:
[Non-query-able: Person affiliated to social security or beneficiary of such a scheme]